satisfying DSM-V criteria for ED and for half of the patients in addition

The above is a clinical trial inclusion criterion. Annotated with entity spans:
[Value: satisfying] [Measurement: DSM-V criteria] for [Condition: ED] [Parsing_Error: and for half of the patients in addition]